Clinical trial inclusion criterion:
Infertile women with eugonadotrophic anovulation/oligoovulation.

Annotated entities:
- Person: "women"
- Condition: "Infertile"
- Condition: "anovulation"
- Condition: "oligoovulation"
- Qualifier: "eugonadotrophic"